Clinical trial exclusion criteria:
Acute critical limb ischemia
Severe critical limb ischemia (Rutherford category 6)
Major bleeding history within prior 2 months
Known hypersensitivity or contraindication to any of the following medications: heparin, aspirin, clopidogrel or contrast agents
Age > 85 years
Severe hepatic dysfunction (> 3 times normal reference values)
Significant renal dysfunction (Serum creatinine > 2.0 mg/dl
Significant leucopenia, neutropenia, thrombocytopenia, anemia, or known bleeding diathesis
LVEF <40% or clinically overt congestive heart failure
Pregnant women or women with potential childbearing
Life expectancy <1 year due to comorbidity
Previous bypass surgery or stenting of the superficial femoral artery
Untreated inflow disease of the ipsilateral pelvic arteries (more than 50%stenosis or or occlusion
Popliteal artery stenosis >50% at P2 or P3 segment

Annotated entities:
- Temporal: "Acute"
- Qualifier: "critical"
- Condition: "limb ischemia"
- Qualifier: "Severe"
- Qualifier: "critical"
- Condition: "limb ischemia"
- Measurement: "Rutherford category"
- Value: "6"
- Condition: "Major bleeding history"
- Temporal: "within prior 2 months"
- Condition: "hypersensitivity"
- Condition: "contraindication"
- Drug: "heparin"
- Drug: "aspirin"
- Drug: "clopidogrel"
- Drug: "contrast agents"
- Person: "Age"
- Value: "> 85 years"
- Qualifier: "Severe"
- Condition: "hepatic dysfunction"
- Non-representable: "(> 3 times normal reference values)"
- Qualifier: "Significant"
- Condition: "renal dysfunction"
- Measurement: "Serum creatinine"
- Value: "> 2.0 mg/dl"
- Condition: "leucopenia"
- Condition: "neutropenia"
- Condition: "thrombocytopenia"
- Condition: "anemia"
- Condition: "bleeding diathesis"
- Qualifier: "Significant"
- Measurement: "LVEF"
- Value: "<40%"
- Qualifier: "clinically overt"
- Condition: "congestive heart failure"
- Condition: "Pregnant"
- Person: "women"
- Person: "women"
- Condition: "potential childbearing"
- Observation: "Life expectancy"
- Value: "<1 year"
- Condition: "comorbidity"
- Procedure: "bypass surgery"
- Temporal: "Previous"
- Device: "stenting of the superficial femoral artery"
- Qualifier: "Untreated"
- Condition: "inflow disease"
- Qualifier: "ipsilateral pelvic arteries"
- Value: "more than 50%"
- Condition: "stenosis"
- Value: "occlusion"
- Condition: "Popliteal artery stenosis"
- Value: ">50%"
- Qualifier: "P2 or P3 segment"